Clinical trial inclusion criterion:
Arterial occlusive disease per ankle Brachial index measurements and/or other imaging modalities,

Annotated entities:
- Condition: "Arterial occlusive disease"
- Procedure: "ankle Brachial index measurements"
- Procedure: "imaging modalities"